Clinical trial exclusion criterion:
Enrollment time more than 1 hr since arrival to emergency room or PICU

Entity relations:
- Has_index("more than 1 hr since arrival to emergency room or PICU", "arrival to emergency room or PICU")
- multi("arrival to emergency room or PICU", "emergency room")
- Has_temporal("Enrollment", "more than 1 hr since arrival to emergency room or PICU")
- OR("emergency room", "PICU")